Has had major psychiatric illness and/or substance abuse problems during the past 12 months (including hospitalization or periods of work disability) that in the opinion of the investigator would preclude participation

The above is a clinical trial exclusion criterion. Annotated with entity spans:
Has had [Qualifier: major] [Condition: psychiatric illness] and/or [Condition: substance abuse] problems [Temporal: during the past 12 months] (including [Procedure: hospitalization] or periods of [Condition: work disability]) that [Subjective_judgement: in the opinion of the investigator] would [Context_Error: preclude participation]